Clinical trial exclusion criteria:
Previous treatment with brentuximab vedotin.
Previously received an allogeneic transplant.
Patients with current diagnosis of primary cutaneous ALCL (patients whose ALCL has transformed to sALCL are eligible).
Known cerebral/meningeal disease including signs or symptoms of progressive multifocal leukoencephalopathy (PML)
Female patients who are lactating and breastfeeding or pregnant
Known human immunodeficiency virus (HIV) positive
Known hepatitis B surface antigen-positive, or known or suspected active hepatitis C infection

Annotated entities:
- Drug: "brentuximab"
- Procedure: "allogeneic transplant"
- Condition: "primary cutaneous ALCL"
- Condition: "sALCL"
- Condition: "meningeal disease"
- Condition: "cerebral disease"
- Condition: "progressive multifocal leukoencephalopathy"
- Condition: "PML"
- Pregnancy_considerations: "Female patients who are lactating and breastfeeding or pregnant"
- Measurement: "human immunodeficiency virus"
- Measurement: "HIV"
- Value: "positive"
- Measurement: "hepatitis B surface antigen"
- Value: "positive"
- Condition: "hepatitis C infection"
- Qualifier: "active"